significant history of head trauma/surgery or seizure disorder

The above is a clinical trial exclusion criterion. Annotated with entity spans:
[Qualifier: significant] [Temporal: history] of [Condition: head trauma]/surgery or [Condition: seizure disorder]